Clinical trial exclusion criterion:
History of major organ transplantation with an existing functional graft.

Annotated entities:
- Condition: "major organ transplantation"
- Qualifier: "existing functional graft"